下列何種藥物具有作用在melatonin（MT1）和MT2的受體，但不具有成癮性，可以用來治療失眠的病人？
A. ketanserin
B. lorcaserin
C. ramelteon
D. repinotan

正確答案：C. ramelteon